Clinical trial exclusion criteria:
Inability to perform exercise tests
Diagnosed psychiatric or cognitive disorders
Progressive neurological or neuromuscular disorders having a major impact on exercise capacity

Annotated entities:
- Condition: "Inability to perform"
- Procedure: "exercise tests"
- Condition: "cognitive disorders"
- Condition: "psychiatric disorders"
- Condition: "disorders Progressive neurological"
- Condition: "neuromuscular disorders Progressive"
- Condition: "impact on exercise capacity"